what is the effect of Bisphenol A in the body?

Bisphenol A (BPA) is an endocrine-disruptor compound that exhibits estrogenic activit